Clinical trial inclusion criterion:
Term singleton infants (>37 weeks gestational age)

Annotated entities:
- Condition: "singleton infants"
- Condition: "Term infants"
- Value: ">37 weeks"
- Measurement: "gestational age"